Clinical trial exclusion criterion:
Diagnosis of other functional diseases of the digestive system, such as dyskinesia of cystic duct or gallbladder, irritable bowel syndrome, etc.

Annotated entities:
- Condition: "functional diseases"
- Qualifier: "digestive system"
- Condition: "dyskinesia of cystic duct"
- Condition: "dyskinesia of gallbladder"
- Condition: "irritable bowel syndrome"